other procedures that mandate addition of "trocar(s)" or "feeding tube"

The above is a clinical trial exclusion criterion. Annotated with entity spans:
[Non-representable: other procedures that mandate addition of "trocar(s)" or "feeding tube"]